Clinical trial exclusion criterion:
Cardiac dysrhythmia precluding treatment with domperidone or apomorphine (increased QTc = 440 ms in men, QTc = 450 ms in women)

Entity relations:
- Has_negation("domperidone", "precluding")
- AND("Cardiac dysrhythmia", "domperidone")
- Has_value("QTc", "= 440 ms")
- Has_value("QTc", "= 450 ms")
- AND("men", "QTc")
- AND("women", "QTc")
- Subsumes("Cardiac dysrhythmia", "men")
- OR("domperidone", "apomorphine")
- OR("men", "women")